Ability of perform a maximal exercise test as defined by a respiratory exchange ratio (RER) greater than 1.0 at the time of maximal exercise

The above is a clinical trial inclusion criterion. Annotated with entity spans:
[Observation: Ability of perform] a [Procedure: maximal exercise test] as defined by a [Measurement: respiratory exchange ratio (RER)] [Value: greater than 1.0] [Qualifier: at the time of maximal exercise]